Clinical trial exclusion criterion:
Other inflammatory Knee Osteoarthritis (e.g. gout, rheumatoid arthritis, etc.)

Entity relations:
- Has_qualifier("inflammatory Knee Osteoarthritis", "Other")
- Subsumes("inflammatory Knee Osteoarthritis", "gout")
- OR("gout", "rheumatoid arthritis")